Un paciente acude a la consulta de enfermería porque quiere perder peso y dice: “Estoy pensando en llevar una dieta y hacer ejercicio, pero ahora no me viene bien”. El profesional responde: “Está usted diciendo que quiere perder peso pero que ahora no es buen momento. Dígame, ¿qué va a hacer?” La enfermera está utilizando como estrategias comunicativas:
1. La técnica de la paráfrasis y la confrontación.
2. La técnica de la reestructuración cognitiva y el razonamiento dicotómico.
3. Un estilo agresivo y manipulativo de la comunicación.
4. El feedback y la desensibilización sistemática.
5. El resumen y la comprobación de la asimilación.

Respuesta correcta: 1. La técnica de la paráfrasis y la confrontación.